Patients with genetic diseases such as galactose intolerance, Lapp lactase deficiency, or glucose-galactose malabsorption.

The above is a clinical trial exclusion criterion. Annotated with entity spans:
Patients with [Condition: genetic diseases] such as [Condition: galactose intolerance], [Condition: Lapp lactase deficiency], or [Condition: glucose-galactose malabsorption].